下列何者是主要造成子宮前傾（anteflexion）的構造？
A. 闊韌帶（broad ligament）
B. 主韌帶（cardinal ligament）
C. 子宮圓韌帶（round ligament of the uterus）
D. 子宮薦韌帶（uterosacral ligament）

正確答案：C. 子宮圓韌帶（round ligament of the uterus）